Clinical trial exclusion criterion:
2. Antifungals: itraconazole, ketoconazole, voriconazole

Annotated entities:
- Parsing_Error: "2."
- Drug: "itraconazole"
- Drug: "ketoconazole"
- Drug: "voriconazole"